Patients with diabetes, Ischemic heart disease (IHD), stroke, malignancy and psychiatric diseases are excluded from study.

The above is a clinical trial exclusion criterion. Annotated with entity spans:
Patients with [Condition: diabetes], [Condition: Ischemic heart disease (IHD)], [Condition: stroke], [Condition: malignancy] [Grammar_Error: and] [Condition: psychiatric diseases] are excluded from study.